¿Cómo denominamos a la dimensión del burnout por la cual la persona hace una valoración negativa de su habilidad en el trabajo y en relación con las personas que atiende?:
1. Fatiga de compasión.
2. Baja realización personal.
3. Agotamiento o cansancio emocional.
4. Despersonalización.

Respuesta correcta: 2. Baja realización personal.